Clinical trial exclusion criterion:
Erythropoiesis-stimulating agents (ESA) administered within 4 weeks prior to Screening

Entity relations:
- Subsumes("Erythropoiesis-stimulating agents", "ESA")
- Has_index("within 4 weeks prior to Screening", "Screening")